Planned kidney transplant in the next 4 months

The above is a clinical trial exclusion criterion. Annotated with entity spans:
[Qualifier: Planned] [Condition: kidney transplant] [Temporal: in the next 4 months]